Contraindication to spinal anaesthesia

The above is a clinical trial exclusion criterion. Annotated with entity spans:
[Condition: Contraindication] to [Procedure: spinal anaesthesia]